Clinical trial exclusion criterion:
Clinically significant current Axis II (DSM-IV-TR) diagnosis

Entity relations:
- Has_qualifier("diagnosis", "Axis II")
- Has_qualifier("diagnosis", "DSM-IV-TR")